國內的成人原發性腎絲球腎炎中（Primary glomerulonephritis），以何種病理變化最為常見？
A. 甲型免疫球蛋白腎病變（IgA nephropathy）
B. 微細病變（Minimal change disease）
C. 膜性腎絲球腎炎（Membranous glomerulonephritis）
D. 膜性增生性腎絲球腎炎（Membranoproliferative glomerulonephritis）

正確答案：A. 甲型免疫球蛋白腎病變（IgA nephropathy）